congenital or valvular cardiomyopathy;

The above is a clinical trial exclusion criterion. Annotated with entity spans:
[Qualifier: congenital] or [Qualifier: valvular] [Condition: cardiomyopathy];